最常造成大腸－膀胱瘻管的病因是下列那一個？
A. 大腸癌
B. Crohn's 症
C. Chronic ulcerative colitis
D. Diverticulitis

正確答案：D. Diverticulitis